Clinical trial exclusion criterion:
History of allergy or idiosyncratic reaction to diltiazem

Annotated entities:
- Condition: "allergy"
- Condition: "idiosyncratic reaction"
- Drug: "diltiazem"